Clinical trial inclusion criterion:
hospitalized for heart failure in last 12 months

Entity relations:
- AND("hospitalized", "heart failure")
- Has_temporal("hospitalized", "in last 12 months")